Clinical trial exclusion criterion:
endometrial hyperplasia with atypia,

Entity relations:
- Has_qualifier("endometrial hyperplasia", "with atypia")